依現行診斷標準，下列四人何者為糖尿病？
A. 66 歲之男性，主訴倦怠口渴及頻尿，其飯前血糖值為 118 mg/dL、飯後血糖值為 188 mg/dL
B. 44 歲之女性呈現倦怠及體重減輕，其不同日子之隨機血糖值為 162 mg/dL 及 175 mg/dL
C. 59 歲之男性無任何症狀，兩次空腹血糖值分別為 139 mg/dL 及 144 mg/dL
D. 38 歲男性，兩次 75 公克之耐糖試驗（OGTT），2 小時血糖值為 179 mg/dL 及 163 mg/dL

正確答案：C. 59 歲之男性無任何症狀，兩次空腹血糖值分別為 139 mg/dL 及 144 mg/dL